Clinical trial exclusion criterion:
Living in a nursing home.

Entity relations:
- AND("Living", "nursing home")